Clinical trial exclusion criterion:
are allergic to influenza vaccination

Annotated entities:
- Drug: "influenza vaccination"
- Condition: "allergic"